Clinical trial exclusion criterion:
Patients with second primary cancer, except:adequately treated non-melanoma skin cancer, curatively treated in-situ cancer of the cervix, or other solid tumor curatively treated with no evidence of disease for <= 5 years.

Annotated entities:
- Qualifier: "second"
- Condition: "primary cancer,"
- Negation: "except"
- Condition: "non-melanoma skin cancer"
- Condition: "in-situ cancer of the cervix"
- Condition: "solid tumor"
- Non-query-able: "solid tumor curatively treated with no evidence of disease for <= 5 years."
- Mood: "treated"
- Mood: "treated"